15. Women who are pregnant, lactating, or unwilling to use contraception if of childbearing potential

The above is a clinical trial exclusion criterion. Annotated with entity spans:
15. Women who are [Condition: pregnant], [Condition: lactating], or [Mood: unwilling] to use [Condition: contraception] if of [Condition: childbearing potential]